cognitive difficulties

The above is a clinical trial exclusion criterion. Annotated with entity spans:
[Condition: cognitive difficulties]